Clinical trial inclusion criteria:
Patients on chronic statin treatment (>30 days) scheduled for isolated CABG, including on- or off-pump or repeat (redo's) revascularisation procedures
Stable or unstable angina, including non ST-segment-elevation acute coronary syndrome (NSTE-ACS)
Age = 18 years
Written informed consent

Annotated entities:
- Multiplier: "chronic"
- Drug: "statin"
- Procedure: "treatment"
- Value: ">30 days"
- Procedure: "CABG"
- Qualifier: "isolated"
- Mood: "scheduled"
- Procedure: "revascularisation procedures"
- Qualifier: "on- or off-pump or repeat"
- Qualifier: "redo's"
- Condition: "Stable angina"
- Condition: "unstable angina"
- Condition: "non ST-segment-elevation acute coronary syndrome"
- Condition: "NSTE-ACS"
- Person: "Age"
- Value: "= 18 years"
- Non-query-able: "Written informed consent"